Objectively confirmed diagnosis of acute PE by multidetector CT angiography, ventilation/perfusion lung scan, or selective invasive pulmonary angiography, according to established diagnostic criteria, with or without symptomatic deep vein thrombosis

The above is a clinical trial inclusion criterion. Annotated with entity spans:
Objectively confirmed diagnosis of [Qualifier: acute] [Condition: PE] by multidetector [Procedure: CT angiography], [Procedure: ventilation/perfusion lung scan], or selective [Procedure: invasive pulmonary angiography,] according to established diagnostic criteria, with or without symptomatic [Condition: deep vein thrombosis]